若顱內腦動脈瘤破裂，則下列治療何者應避免？
A. 嚴格臥床休息
B. 鈣離子阻斷劑：Nimodipine
C. 血壓控制
D. 高度鎮靜治療

正確答案：D. 高度鎮靜治療